COPD exacerbation, very severe COPD with hypoxemia at low altitude (FEV1/FVC <0.7, FEV1 <40% predicted, oxygen saturation on room air <92% at 750 m).

The above is a clinical trial exclusion criterion. Annotated with entity spans:
[Condition: COPD exacerbation], [Qualifier: very severe] [Condition: COPD] with [Condition: hypoxemia] at [Qualifier: low altitude] ([Measurement: FEV1/FVC] [Value: <0.7], [Measurement: FEV1] [Value: <40% predicted], [Measurement: oxygen saturation] on [Qualifier: room air] [Value: <92% at 750 m]).